Known allergies to midodrine hydrochloride;

The above is a clinical trial exclusion criterion. Annotated with entity spans:
Known [Condition: allergies] to [Drug: midodrine hydrochloride];